Clinical trial exclusion criterion:
Uncontrolled myocardial ischemia (repeated chest pain or dyspnea after revascularization)

Entity relations:
- Has_qualifier("myocardial ischemia", "Uncontrolled")
- Has_index("after revascularization", "revascularization")
- multi("revascularization", "revascularization")
- Has_qualifier("chest pain", "repeated")
- Has_temporal("chest pain", "after revascularization")
- Subsumes("myocardial ischemia", "chest pain")
- OR("chest pain", "dyspnea")